Clinical trial inclusion criterion:
Above 18 years of age

Entity relations:
- Has_value("age", "Above 18 years")